關於叢發性頭痛（cluster headache）的敘述，下列何者正確？
A. 女生比男生多
B. 一定是單側的
C. 疼痛時間約4到72小時
D. 每年都一定會發作

正確答案：B. 一定是單側的